Clinical trial exclusion criterion:
current infectious disease, and

Annotated entities:
- Temporal: "current"
- Condition: "infectious disease"